Smilkstein於1978年提出家庭功能評估的APGAR評估量表，其中APGAR各自代表：Adaptation、Partnership、 Growth、Affection、Resolve。這個評估量表最主要來自於何種概念模式？
A. Biopsychosocial model
B. Systems approach
C. Stress and coping model
D. Life span perspective

正確答案：B. Systems approach